Clinical trial exclusion criterion:
Use of pain medication (except paracetamol) within 3 days

Entity relations:
- Has_negation("paracetamol", "except")
- AND("pain medication", "paracetamol")
- Has_temporal("pain medication", "within 3 days")